Clinical trial inclusion criterion:
Right-handed

Annotated entities:
- Condition: "Right-handed"